Any confirmed or suspected immunosuppressive or immunodeficiency condition based on medical history and physical examination

The above is a clinical trial exclusion criterion. Annotated with entity spans:
Any [Qualifier: confirmed] or [Mood: suspected] [Condition: immunosuppressive] or [Condition: immunodeficiency condition] based on [Temporal: medical history] and [Procedure: physical examination]